下列關於感染性心內膜炎的敘述，何者錯誤？
A. 發燒是最常見的臨床症狀
B. 靜脈毒癮患者感染心內膜炎的致病菌以金黃色葡萄球菌（Staphylococcus aureus）最常見
C. 發燒，Roth's spot，以及結膜出血（conjunctival hemorrhage）都是 Duke criteria 內的次要條件
D. 患有左側瓣膜的心內膜炎所需抗生素治療時間為兩週

正確答案：D. 患有左側瓣膜的心內膜炎所需抗生素治療時間為兩週